Clinical trial inclusion criterion:
Creatinine less than or equal to 2.0 x upper limit of normal (ULN)

Annotated entities:
- Measurement: "Creatinine"
- Value: "less than or equal to 2.0 x upper limit of normal (ULN)"